生雞蛋的蛋白中之avidin會影響人類腸道對下列何種維生素的吸收？
A. folate
B. biotin
C. cobalamin
D. pyridoxine

正確答案：B. biotin